Pyonephrosis requiring drainage

The above is a clinical trial exclusion criterion. Annotated with entity spans:
[Condition: Pyonephrosis] [Mood: requiring] [Procedure: drainage]